Clinical trial exclusion criteria:
On chronic treatment (i.e., two weeks or more) with any medication severely affecting oral status (e.g. participants with gingival hypertrophy caused by anti-epileptics, calcium antagonists, cyclosporine and other immunosuppressive) or bone metabolism (e.g. anticoagulant medications, long-standing steroid medications -i.e. equal or more 2.5mg of prednisolone a day taken for >3 months -, anticonvulsants, immunosuppressants).
Affected by systemic diseases recognized to severely affect bone metabolism (e.g. Cushing's syndrome, Addison's disease, diabetes mellitus type 1, leukaemia, pernicious anaemia, malabsorption syndromes, chronic liver disease, rheumatoid arthritis).
Knowingly affected by HIV or Hepatitis.
History of local radiation therapy in the last five years.
Affected by limited mental capacity or language skills such that study information cannot be understood, informed consent cannot be obtained, or simple instructions cannot be followed.
Presenting an acute endodontic/periodontal lesion in the neighboring areas to the implant site.
Completely edentulous
With evident severe atrophy of the alveolar ridge that could preclude an implant placement (e.g. sharp knife edge ridge)
Severe bruxism or clenching habits
Smokers of > 5 cigarettes a day.
A daily alcohol intake >2 units/day.
Other severe acute or chronic medical or psychiatric condition or laboratory abnormality which may increase the risk associated with trial participation or investigational product administration or may interfere with the interpretation of study results and, in the judgment of the investigator, would make the participant inappropriate for entry into this trial.
Patients unable or not willing to return for follow-ups.

Annotated entities:
- Procedure: "treatment"
- Temporal: "two weeks or more"
- Drug: "immunosuppressive"
- Drug: "cyclosporine"
- Drug: "calcium antagonists"
- Drug: "anti-epileptics"
- Condition: "gingival hypertrophy"
- Observation: "bone metabolism"
- Drug: "anticoagulant"
- Drug: "steroid"
- Multiplier: "equal or more 2.5mg a day"
- Drug: "prednisolone"
- Temporal: ">3 months"
- Drug: "anticonvulsants"
- Drug: "immunosuppressants"
- Condition: "Cushing's syndrome"
- Condition: "Addison's disease"
- Condition: "diabetes mellitus type 1"
- Condition: "leukaemia"
- Condition: "pernicious anaemia"
- Condition: "malabsorption syndromes"
- Condition: "chronic liver disease"
- Condition: "rheumatoid arthritis"
- Condition: "Hepatitis"
- Condition: "HIV"
- Procedure: "local radiation therapy"
- Temporal: "last five years"
- Post-eligibility: "ffected by limited mental capacity or language skills such that study information cannot be understood, informed consent cannot be obtained, or simple instructions cannot be followed"
- Condition: "periodontal lesion"
- Condition: "lesion endodontic"
- Condition: "edentulous"
- Qualifier: "Completely"
- Non-query-able: "With evident severe atrophy of the alveolar ridge that could preclude an implant placement (e.g. sharp knife edge ridge)"
- Observation: "clenching habits"
- Observation: "bruxism"
- Person: "Smokers"
- Observation: "cigarettes"
- Multiplier: "> 5 a day"
- Observation: "alcohol"
- Multiplier: ">2 units/day"
- Non-query-able: "Other severe acute or chronic medical or psychiatric condition or laboratory abnormality which may increase the risk associated with trial participation or investigational product administration or may interfere with the interpretation of study results and, in the judgment of the investigator, would make the participant inappropriate for entry into this trial"
- Post-eligibility: "Patients unable or not willing to return for follow-ups"